From which tissue was the NCI-H520 cell-line derived?

The NCI-H520 cell-line is derived from human non-small cell lung cancer tissue.